Clinical trial exclusion criterion:
Cognitive impairment

Annotated entities:
- Condition: "Cognitive impairment"